Clinical trial exclusion criterion:
Screening stool study positive for enteric pathogens or Clostridium difficile toxin.

Annotated entities:
- Procedure: "stool study"
- Value: "positive"
- Qualifier: "enteric pathogens"
- Qualifier: "Clostridium difficile toxin"